一位45歲男性病人，無藥物過敏史。昨天開始發燒、喉嚨疼痛，自行服用止痛藥後完全沒有緩解。今日甚至出現吞嚥與呼吸困難的現象因而來急診求診，你觀察到此病人張	口呼吸有喘鳴音（stridor），嘴角有流口水，下列處置何者最不恰當？
A. 給予氧氣
B. 靜脈輸液（fluid hydration）
C. 讓病人平躺休息
D. 給予抗生素（antibiotics）

正確答案：C. 讓病人平躺休息